一位 40 歲男性病人，主述全身輕微癢的皮膚病灶約 5 年，在冬天惡化，身體檢查（physical examination）發現丘疹、斑塊伴隨著厚厚的鱗屑主要分布在頭皮、軀幹和四肢伸側，移除鱗屑時會出現點狀出血 ，合理的診斷為：
A. 脂漏性皮膚炎（seborrheic dermatitis）
B. 慢性苔癬皮膚炎（lichen simplex chronicus）
C. 尋常性乾癬（psoriasis vulgaris）
D. 體癬（tinea corporis）

正確答案：C. 尋常性乾癬（psoriasis vulgaris）